La FAB (fragmentos de anticuerpos ligadores de antígenos) se emplean como antídotos frente a la intoxicación por:
1. Digoxina.
2. Barbitúricos.
3. Derivado anfetamínicos.
4. Salicilatos.
5. Antihistamínicos.

Respuesta correcta: 1. Digoxina.